Has portal vein invasion at the main portal branch (Vp4), inferior vena cava, or cardiac involvement of HCC based on imaging

The above is a clinical trial exclusion criterion. Annotated with entity spans:
Has [Condition: portal vein invasion] at the [Qualifier: main portal branch (Vp4)], [Qualifier: inferior vena cava], or [Condition: cardiac involvement] of [Condition: HCC] based on [Procedure: imaging]